下列有關腸病毒（enterovirus）的敘述，何者錯誤？
A. 主要由糞－口傳染
B. 1998 年台灣大流行，造成死亡的個案，主要是由 71 型腸病毒所引起的腦炎（encephalitis）
C. 新生兒是腸病毒重症高危險群，主要是死於肝臟壞死（hepatic necrosis）
D. 嬰兒感染常常造成嘔吐、腹瀉等症狀

正確答案：D. 嬰兒感染常常造成嘔吐、腹瀉等症狀